Clinical trial exclusion criterion:
Patients who are legally detained in an official institution.

Entity relations:
- AND("legally detained", "official institution")